Clinical trial exclusion criterion:
6. Lifetime history of major depressive disorder, schizophrenia, bipolar disorder, mania, or hypomania.

Entity relations:
- Has_temporal("major depressive disorder", "Lifetime history of")
- OR("major depressive disorder", "mania", "bipolar disorder", "schizophrenia", "hypomania")